History of penetrating head injury

The above is a clinical trial exclusion criterion. Annotated with entity spans:
History of [Condition: penetrating head injury]